Clinical trial exclusion criterion:
Current pregnancy or lactation

Entity relations:
- OR("pregnancy", "lactation")